Which epigenetic mark is deposited by PRC2?

H3K27me3 is the major histone methyltransferase activity of PRC2.